El ciclo de Cori:
1. Implica la síntesis y la degradación de glucógeno.
2. No implica la conversión de lactato en piruvato.
3. Únicamente tiene lugar en el hígado.
4. Oxida ácidos tricarboxílicos.
5. Implica glicolisis y gluconeogénesis.

Respuesta correcta: 5. Implica glicolisis y gluconeogénesis.